Clinical trial exclusion criterion:
Unstable/rapidly progressing renal disease or estimated Glomerular Filtration Rate < 60 mL/min (Cockcroft-Gault formula).

Annotated entities:
- Qualifier: "rapidly progressing"
- Qualifier: "Unstable"
- Condition: "renal disease"
- Measurement: "estimated Glomerular Filtration Rate"
- Value: "< 60 mL/min"
- Qualifier: "Cockcroft-Gault formula"